Subject has bone abnormalities preventing safe screw fixation.

The above is a clinical trial inclusion criterion. Annotated with entity spans:
Subject has [Condition: bone abnormalities] [Negation: preventing] [Qualifier: safe] [Procedure: screw fixation].